Clinical trial inclusion criterion:
undergoing day-case knee arthroscopy

Annotated entities:
- Procedure: "knee arthroscopy"